pregnant or lactating women,

The above is a clinical trial inclusion criterion. Annotated with entity spans:
[Condition: pregnant] or [Condition: lactating] [Person: women],